Herpes viruses have what type of genome?

Herpes viruses have a linear, double-stranded DNA genome.